Significant alcohol intake

The above is a clinical trial exclusion criterion. Annotated with entity spans:
[Qualifier: Significant] [Observation: alcohol intake]